PaO2 > 45 mm Hg on room air

The above is a clinical trial inclusion criterion. Annotated with entity spans:
[Measurement: PaO2] [Value: > 45 mm Hg] [Qualifier: on room air]